Clinical trial exclusion criterion:
The patients have severe non-cancerous diseases.

Annotated entities:
- Qualifier: "severe"
- Condition: "non-cancerous diseases"